Clinical trial exclusion criterion:
taking prescribed gabapentin at the time of admission for CD

Entity relations:
- Has_qualifier("gabapentin", "prescribed")
- AND("admission", "CD")
- multi("admission for CD", "admission")
- Has_index("at the time of admission for CD", "admission for CD")
- Has_temporal("gabapentin", "at the time of admission for CD")